En una mujer gestante de 32 semanas se escucha el latido cardiaco fetal. ¿Qué maniobra de Leopold se debe realizar para conocer dónde se encuentra el dorso fetal?:
1. La primera.
2. La segunda.
3. La tercera.
4. La cuarta.
5. La quinta.

Respuesta correcta: 2. La segunda.